What tissues have been studied by circadian proteomics?

Retina
Liver